Which drugs were included in the polypill that was tested in TIPS-3 trial?

Polypill tested in the TIPS-3 trial was comprised of atenolol, ramipril, hydrochlorothiazide, and a statin.